Contraindication of CT Known allergy to iodinated contrast media or history of contrast-induced nephropathy Decreased renal function: elevated serum creatinine(>1.5mg/dl) Contraindication to beta-blockers Severe arrhythmia: arterial fibrillation or uncontrolled tachyarrhythmia, or advanced atrioventricular block (second or third degree heart block)

The above is a clinical trial exclusion criterion. Annotated with entity spans:
[Condition: Contraindication of CT] [Line: Known allergy to iodinated contrast media or history of contrast-induced nephropathy] [Line: Decreased renal function: elevated serum creatinine(>1.5mg/dl)] [Line: Contraindication to beta-blockers] [Line: Severe arrhythmia: arterial fibrillation or uncontrolled tachyarrhythmia, or advanced atrioventricular block (second or third degree heart block)]